Clinical trial exclusion criterion:
Recently suffered from MI or CVA.

Annotated entities:
- Condition: "MI"
- Condition: "CVA"
- Temporal: "Recently"